Diabetes (to improve the PET imaging quality)

The above is a clinical trial exclusion criterion. Annotated with entity spans:
[Condition: Diabetes] (to improve the [Procedure: PET imaging quality])